Clinical trial exclusion criterion:
Allergy to methadone, hydromorphone, or ketamine

Annotated entities:
- Drug: "methadone"
- Drug: "hydromorphone"
- Drug: "ketamine"